Clinical trial inclusion criterion:
Has no history of untreated latent or active tuberculosis (TB) prior to Screening

Annotated entities:
- Qualifier: "active"
- Qualifier: "untreated"
- Qualifier: "latent"
- Condition: "tuberculosis (TB)"
- Negation: "no"
- Temporal: "history"
- Temporal: "prior to Screening"
- Reference_point: "Screening"